Clinical trial exclusion criterion:
Current viral or bacterial infection.

Annotated entities:
- Condition: "bacterial infection"
- Condition: "infection viral"
- Temporal: "Current"